Patients deemed as resectable by pancreatic protocol CT or MRI

The above is a clinical trial inclusion criterion. Annotated with entity spans:
Patients [Condition: deemed as resectable] by [Procedure: pancreatic protocol CT] or MRI